¿Cuál de las siguientes alteraciones se clasifica como una distorsión perceptiva de la integración?:
1. Dismegalopsia.
2. Dismorfopsia.
3. Sinestesia.
4. Metamorfopsia.

Respuesta correcta: 3. Sinestesia.